En un estudio clínico para evaluar la eficacia de un nuevo medicamento en el tratamiento de la crisis de migraña (señale la CORRECTA):
1. Unos criterios de inclusión estrictos aumentan la validez externa del estudio.
2. Unos criterios de exclusión estrictos reducen la validez interna del estudio.
3. El control con un brazo placebo aumenta la validez externa del estudio.
4. El enmascaramiento reduce la validez interna del estudio.
5. La asignación aleatoria aumenta la validez interna del estudio.

Respuesta correcta: 5. La asignación aleatoria aumenta la validez interna del estudio.